急性躁症患者以鋰鹽治療時，急性發作（acute mania）時患者之鋰鹽血液濃度應維持在下列何範圍內為宜？
A. 1.2 ~ 1.8 meq/L
B. 0.6 ~ 1.6 meq/L
C. 1.0 ~ 1.5 meq/L
D. 0.6 ~ 1.0 meq/L

正確答案：C. 1.0 ~ 1.5 meq/L